一位 55 歲病人，因為呼吸急促、牙齦出血來到急診處。理學檢查顯示體溫為 39℃，意識清楚，身上有多處瘀青。抽血檢查結果如下：血紅素 7.8 gm/dL，白血球 215,000/μL，其中 blast 88.5%，band 1.5%， segmented neutrophil 2.5%，monocyte 2.5%，lymphocyte 5%，血小板 5,000/μL；芽細胞中 15%為 peroxidase 陽性，胸部 X 光及尿液檢查無異常。下列何者不正確？
A. 白血球過高可能有白血球鬱積症（leukostasis），需要做白血球分離術
B. 血小板數目太低且有出血傾向，需要輸注血小板濃縮液
C. 發燒可能是有感染，須做微生物培養，並開始抗生素治療
D. 為急性骨髓性白血病，需儘早做化學治療 HOP（adriamycin, vincristine, prednisolone）

正確答案：D. 為急性骨髓性白血病，需儘早做化學治療 HOP（adriamycin, vincristine, prednisolone）